Clinical trial inclusion criteria:
CKD patients classified as Stage 3 and 4 of National Kidney Foundation Classification with estimated glomerular filtration rate (GFR) between 15 and 59 mL/min/1.73 m2 according to the Modification of Diet in Renal Disease (MDRD) formula based on serum creatinine, age, gender, and race.
Men and women 35 to 70 years of age

Annotated entities:
- Condition: "CKD"
- Value: "Stage 3"
- Value: "Stage 4"
- Measurement: "National Kidney Foundation Classification"
- Measurement: "estimated glomerular filtration rate (GFR)"
- Value: "between 15 and 59 mL/min/1.73 m2"
- Qualifier: "Modification of Diet in Renal Disease (MDRD) formula"
- Person: "Men"
- Person: "women"
- Value: "35 to 70 years"
- Person: "age"